What percentage of human genes have no introns?

About 3% of human genes have no introns.  URL_0